白喉棒狀桿菌（Corynebacterium diphtheriae）之致病因素為：
A. 放出外毒素，抑制蛋白質合成
B. 抑制吞噬細胞，產生肉芽腫
C. 放出內毒素，造成發燒休克
D. 破壞上皮細胞，造成血管炎

正確答案：A. 放出外毒素，抑制蛋白質合成